下列有關膠原蛋白（collagen）之敘述，何者正確？
A. 膠原蛋白螺旋（collagen helix）的α鏈（α chain）由三個胺基酸重複出現的右手型（right-handed）螺旋所構成
B. 其每一圈（turn）含有四個胺基酸殘基（amino acid residues）
C. 其構造中通常含有 Glu-X-Y 重複出現的結構
D. 其含有特殊胺基酸羥脯胺酸（4-hydroxyproline）

正確答案：D. 其含有特殊胺基酸羥脯胺酸（4-hydroxyproline）